Clinical trial exclusion criterion:
7. Platelet count < 100,000

Annotated entities:
- Parsing_Error: "7."
- Measurement: "Platelet count"
- Value: "< 100,000"